Clinical trial exclusion criterion:
10. Women currently taking spironolactone

Annotated entities:
- Parsing_Error: "10."
- Person: "Women"
- Drug: "spironolactone"